一位病友疑似誤食遭到日本福島核災幅射塵污染之食物。除可使用碘化鉀（potassium iodide）治療碘（iodine）-131污染外，亦可使用下列何者治療銫（cesium）-137污染？
A. aluminum phosphate
B. bicarbonate
C. calcium diethylenetriaminopentaacetate
D. Prussian blue

正確答案：D. Prussian blue